肋間神經（intercostal nerve）之外側皮支（lateral cutaneous branch），一般由下列何處鑽出？
A. 肋骨角（costal angle）
B. 肩胛骨線（scapular line）
C. 正中腋線（midaxillary line）
D. 正中鎖骨線（midclavicular line）

正確答案：C. 正中腋線（midaxillary line）